cervix flushed with the vagina.

The above is a clinical trial exclusion criterion. Annotated with entity spans:
[Condition: cervix flushed with the vagina].